What syndrome is associated with mutations in lysine methyltransferase 2D KMT2D?

Kabuki syndrome is a rare autosomal dominant disorder caused by mutations in the lysine methyltransferase 2D (KMT2D) gene.